雌激素（estrogen）分泌量在月經週期（menstrual cycle）中何時最高？其主要作用為何？
A. 濾泡期（follicular phase）；促進濾泡生長
B. 排卵（ovulation）前約24小時；促進黃體刺激素潮放（LH surge）
C. 黃體期（luteal phase）；促進子宮內膜增厚
D. 經期（menstruation）；促進子宮內膜崩潰

正確答案：B. 排卵（ovulation）前約24小時；促進黃體刺激素潮放（LH surge）